Known or suspected haemoglobinopathy/thalassaemia

The above is a clinical trial exclusion criterion. Annotated with entity spans:
[Mood: Known] or [Mood: suspected] [Condition: haemoglobinopathy]/[Condition: thalassaemia]